Clinical trial exclusion criteria:
Inability to understand and read English.
Women pregnant or lactating.
persons with terminal illness

Annotated entities:
- Observation: "Inability to understand and read English"
- Person: "Women"
- Condition: "pregnant"
- Condition: "lactating"
- Condition: "terminal illness"